下列腦膜瘤（meningiomas）中，何者不由內頸動脈（internal carotid artery）供應血流 ？
A. 嗅溝腦膜瘤（olfactory groove meningioma）
B. 蝶骨翼腦膜瘤（sphenoid wing meningioma）
C. 側腦室腦膜瘤（lateral ventricle meningioma）
D. 顱凸處腦膜瘤（cranial convexity meningioma）

正確答案：D. 顱凸處腦膜瘤（cranial convexity meningioma）